Clinical trial exclusion criterion:
inflammatory or chronic disorder

Annotated entities:
- Condition: "disorder inflammatory"
- Condition: "chronic disorder"